Clinical trial inclusion criterion:
Anticipated discontinuation of clopidogrel or ticagrelor within the 12 month follow up period, example for elective surgery

Annotated entities:
- Drug: "clopidogrel"
- Drug: "ticagrelor"
- Temporal: "within the 12 month follow up period"
- Procedure: "elective surgery"
- Mood: "example for"